Females who are pregnant as determined by positive pregnancy test on or before the day of surgery.

The above is a clinical trial exclusion criterion. Annotated with entity spans:
[Pregnancy_considerations: Females who are pregnant as determined by positive pregnancy test on or before the day of surgery].